Clinical trial exclusion criterion:
For HCV-negative, healthy volunteers: History of HCV infection or positive HCV antibody test

Entity relations:
- Has_value("HCV", "negative")